Clinical trial exclusion criterion:
preoperative use of opioid drugs (excl. codeine, tramadol)

Annotated entities:
- Temporal: "preoperative"
- Drug: "opioid drugs"
- Negation: "excl."
- Drug: "codeine"
- Drug: "tramadol"